Clinical trial exclusion criterion:
Current use of a third generation beta-blocker (nebivolol, carvedilol, or labetalol) or high dose of any beta-blockers (greater than 100 mg daily of metoprolol, or equivalent)

Annotated entities:
- Drug: "third generation beta-blocker"
- Drug: "nebivolol"
- Drug: "carvedilol"
- Drug: "labetalol"
- Multiplier: "high dose"
- Drug: "any beta-blockers"
- Multiplier: "greater than 100 mg daily"
- Drug: "metoprolol"